Clinical trial exclusion criterion:
Allergy to LA

Entity relations:
- AND("Allergy", "LA")